李小姐最近兩個月常常突發心悸、喘不過氣，快要昏倒的感覺。經急診醫師診察後，血液生化及心電圖檢查均正常，動脈血氣體檢查呈現輕微呼吸性鹼中毒的現象，被診斷為恐慌發作，給藥 paroxetine 20 mg/錠，每天晚上一顆，及 alprazolam 0.5 mg/錠，發作時才服用。李小姐回家服用後，出現噁心、白天想睡、晚上睡不著的現象，因此，停用 paroxetine，另外，又擔心 alprazolam 吃了會習慣，因此也不敢服用。下列處置何者錯誤？
A. 認知治療：教導不要將輕微的身體症狀誤認為致命性的症狀，告知恐慌症的生理病理機制，症狀是短暫的現象，通常不會有致命性
B. 行為治療：教導胸式呼吸及漸進式呼吸放鬆訓練，來減低焦慮及避免換氣過度
C. 選擇性血清素再吸收抑制劑（SSRIs）：鼓勵病人繼續使用選擇性血清素再吸收抑制劑到病情穩定後，再繼續治療至少 8-12 個月。初期 paroxetine 可以先減半服用，或改用比較不會鎮靜的 sertraline
D. 併用苯二氮平類藥物（benzodiazepine, BZDs）：初期併用苯二氮平類藥物與選擇性血清素再吸收抑制劑約 4-12 週，等選擇性血清素再吸收抑制劑發生療效後，再利用 4-10 週的時間慢慢將苯二氮平類藥物停掉

正確答案：B. 行為治療：教導胸式呼吸及漸進式呼吸放鬆訓練，來減低焦慮及避免換氣過度